Clinical trial exclusion criterion:
2. Use of any medication known to alter hepatic enzyme activity within 28 days prior to the initial dose of study medication.

Annotated entities:
- Parsing_Error: "2."
- Drug: "medication known to alter hepatic enzyme activity"
- Temporal: "within 28 days prior"
- Reference_point: "the initial dose of study medication"